Clinical trial inclusion criteria:
History of three or more consecutively failed In Vitro Fertilization (IVF) cycles after embryo transfer.
Normal uterine cavity (as assessed by hysteroscopy or HSG).
Normal hormonal investigation: TSH, PRL, FBS.
Normal acquired/inherited thrombophilia profile: LAC, ACA IgG/IgM, Prot S, Antithrombin III, beta-2 glycoprotein, Factors V, II, MTHFR.
Normal semen analysis and mild/moderate male factor (Total motile sperm count > 5 million/ml and/or normal WHO morphology >20%.
Patient provides written informed consent.

Annotated entities:
- Multiplier: "three or more"
- Qualifier: "consecutively failed"
- Procedure: "In Vitro Fertilization"
- Procedure: "IVF"
- Temporal: "after embryo transfer"
- Reference_point: "embryo transfer"
- Observation: "uterine cavity"
- Value: "Normal"
- Procedure: "hysteroscopy"
- Procedure: "HSG"
- Procedure: "hormonal investigation:"
- Value: "Normal"
- Measurement: "TSH"
- Measurement: "PRL"
- Measurement: "FBS"
- Measurement: "thrombophilia profile"
- Value: "Normal"
- Measurement: "LAC"
- Measurement: "ACA IgG"
- Measurement: "Prot S"
- Measurement: "Antithrombin III"
- Measurement: "ACA IgM"
- Measurement: "beta-2 glycoprotein"
- Measurement: "Factors V"
- Measurement: "Factors II"
- Measurement: "MTHFR"
- Measurement: "semen analysis"
- Condition: "male factor"
- Qualifier: "moderate"
- Qualifier: "mild"
- Measurement: "Total motile sperm count"
- Value: "> 5 million/ml"
- Measurement: "normal WHO morphology"
- Value: ">20%"
- Informed_consent: "Patient provides written informed consent"